¿A cuál de los siguientes problemas del recién nacido se asocia la carencia de folato durante las primeras semanas tras la concepción?:
1. Anemia.
2. Defectos del tubo neural.
3. Bajo peso al nacer.
4. Parto prematuro.
5. Hemorragia del recién nacido.

Respuesta correcta: 2. Defectos del tubo neural.